List Kartagener Syndrome Triad.

The triad of situs inversus, bronchiectasis and sinusitis is known as Kartagener syndrome.